Patients using medication that could potentiate the effect of botulinum (ex: aminoglycoside antibiotics)

The above is a clinical trial exclusion criterion. Annotated with entity spans:
Patients using [Drug: medication] that could [Condition: potentiate the effect] of [Drug: botulinum] (ex: [Drug: aminoglycoside antibiotics])